Women with a singleton pregnancy undergoing cesarean section after 37 weeks of gestation.

The above is a clinical trial inclusion criterion. Annotated with entity spans:
Women with a [Condition: singleton pregnancy] undergoing [Procedure: cesarean section] [Value: after 37 weeks] of [Measurement: gestation].